Clinical trial exclusion criterion:
Earlier participation in a clinical study performed with cis-UCA

Annotated entities:
- Non-query-able: "Earlier participation in a clinical study performed with cis-UCA"